Clinical trial exclusion criterion:
significant musculoskeletal or cardiopulmonary diseases;

Annotated entities:
- Condition: "cardiopulmonary diseases"
- Condition: "musculoskeletal diseases"
- Qualifier: "significant"
- Subjective_judgement: "significant"
- Undefined_semantics: "significant"